Clinical trial exclusion criterion:
HEALTHY: known cardiovascular disease, cardiac risk factors or use of cardiac medications

Entity relations:
- AND("HEALTHY", "cardiovascular disease")
- OR("cardiovascular disease", "cardiac medications", "cardiac risk factors")